Clinical trial exclusion criterion:
Significant GI disease, previous major gastric/bowel surgery, difficulty swallowing or malabsorption syndrome.

Entity relations:
- Has_qualifier("GI disease", "Significant")
- Has_qualifier("gastric surgery", "major")
- AND("gastric surgery", "difficulty swallowing")
- OR("gastric surgery", "bowel surgery")
- OR("difficulty swallowing", "malabsorption syndrome")